Clinical trial inclusion criterion:
History of positive skin prick test or blood radio-allergosorbent test (RAST) to grass and/or ragweed pollen

Entity relations:
- Has_value("skin prick test", "positive")
- Has_value("blood radio-allergosorbent test (RAST)", "positive")
- Has_qualifier("blood radio-allergosorbent test (RAST)", "grass")
- OR("grass", "ragweed pollen")